劉太太今年 38 歲，丈夫劉先生今年 52 歲，接受人工生殖進行試管嬰兒而順利懷孕。劉太太擔心自己是高齡產婦，關於她此次懷孕的敘述，下列何者錯誤？
A. 若進行試管嬰兒時有接受精蟲注射（intracytoplasmic sperm injection, ICSI），不會提高胎兒染色體異常的風險
B. 高齡父親並不會增加胎兒唐氏症的風險
C. 約有 50%的胚胎死亡原因是因為染色體異常
D. 唐氏症的發生原因常常是卵子在進行減數分裂時發生分離不完全（nondisjunction）所導致

正確答案：A. 若進行試管嬰兒時有接受精蟲注射（intracytoplasmic sperm injection, ICSI），不會提高胎兒染色體異常的風險